Clinical trial inclusion criterion:
Receive prior treatment including first-line platinum-based chemotherapy, standard second-line chemotherapy and 1 EGF/EGFR inhibitor

Annotated entities:
- Procedure: "treatment"
- Procedure: "platinum-based chemotherapy"
- Procedure: "second-line chemotherapy"
- Drug: "1 EGF/EGFR inhibitor"
- Qualifier: "standard"